Clinical trial exclusion criterion:
Glomerular primary focal and segmental sclerosis

Entity relations:
- OR("Glomerular segmental sclerosis", "Glomerular primary focal sclerosis")